Clinical trial exclusion criterion:
Life expectancy < 6 months (e.g., terminal cancer)

Annotated entities:
- Observation: "Life expectancy"
- Value: "< 6 months"
- Condition: "terminal cancer"